Clinical trial exclusion criterion:
Minimum joint space > 2 mm as measured on AP radiograph

Annotated entities:
- Measurement: "Minimum joint space"
- Value: "> 2 mm"
- Procedure: "AP radiograph"